Age from 40 to 75 years

The above is a clinical trial inclusion criterion. Annotated with entity spans:
[Person: Age] [Value: from 40 to 75 years]